Permite comparar proporciones de dos muestras independientes el test estadístico:
1. De McNemar.
2. De Snedecor.
3. De la mediana.
4. Exacto de Fisher.
5. De U de Mann-Whitney.

Respuesta correcta: 4. Exacto de Fisher.